Clinical trial exclusion criterion:
Subject not fluent in English or an appropriate translator not available

Annotated entities:
- Post-eligibility: "Subject not fluent in English or an appropriate translator not available"